Mevalonate 是膽固醇的前驅物，每形成一分子的膽固醇須多少分子的 Mevalonate？
A. 3
B. 4
C. 5
D. 6

正確答案：D. 6